Clinical trial inclusion criterion:
Prior treatment for lymphoid malignancy for progressive /refractory disease

Entity relations:
- OR("Prior", "treatment")
- OR("progressive disease", "refractory disease")